Clinical trial exclusion criterion:
Subject with clinically significant chronic hematological disease which could lead to priapism such as sickle cell anemia, multiple myeloma, and leukemia

Entity relations:
- Has_qualifier("hematological disease", "chronic")
- Has_qualifier("hematological disease", "clinically significant")
- multi("could lead to priapism", "priapism")
- Subsumes("could lead to priapism", "sickle cell anemia")
- Has_qualifier("hematological disease", "could lead to priapism")
- OR("sickle cell anemia", "multiple myeloma", "leukemia")